Contra-indication for multiorgan procurement (infections, cancer, etc)

The above is a clinical trial exclusion criterion. Annotated with entity spans:
[Condition: Contra-indication] for [Procedure: multiorgan procurement] ([Condition: infections], [Condition: cancer], etc)